Clinical trial inclusion criterion:
Frozen embryo transfer cycles: at least 2 embryos

Entity relations:
- Has_multiplier("embryos", "at least 2")
- AND("Frozen embryo transfer cycles", "embryos")